Clinical trial inclusion criterion:
Type I or II diabetes mellitus.

Annotated entities:
- Condition: "Type II diabetes mellitus"
- Condition: "Type I diabetes mellitus"